Clinical trial exclusion criterion:
Any condition or procedure that has compromised neurological control of the upper airway

Annotated entities:
- Non-query-able: "Any condition or procedure that has compromised neurological control of the upper airway"